有關告知義務，下列何者正確？
A. 病患家屬要求不要告知病患真實病情時，醫師得在病人詢問時，隱瞞其相關病情
B. 醫師為病患利益而不告知屬「業務上正當行為」
C. 只要家屬要求不予告知病人，醫師得免除說明義務
D. 在尊重家屬意見時，應先尊重病患之意願，並遵守法律義務

正確答案：D. 在尊重家屬意見時，應先尊重病患之意願，並遵守法律義務